La evaluación de la actividad electrodérmica permite una medida de:
1. La activación general del Sistema Nervioso Autónomo.
2. La activación parasimpática.
3. La actividad visceral.
4. La actitud cortical.
5. El ritmo Delta.

Respuesta correcta: 1. La activación general del Sistema Nervioso Autónomo.